Clinical trial exclusion criterion:
Patients with allergy or intolerance to any of the drugs used.

Entity relations:
- AND("allergy", "drugs")
- OR("allergy", "intolerance")